Has known intolerance or documented adverse reaction to acetaminophen or naproxen or celecoxib

The above is a clinical trial exclusion criterion. Annotated with entity spans:
Has known [Condition: intolerance] or documented [Condition: adverse reaction] to [Drug: acetaminophen] or [Drug: naproxen] or [Drug: celecoxib]